Previous exposure to cytotoxic drugs or pelvic irradiation.

The above is a clinical trial exclusion criterion. Annotated with entity spans:
Previous exposure to [Drug: cytotoxic drugs] or [Procedure: pelvic irradiation].